Clinical trial exclusion criterion:
Pulmonary abnormalities or breast x-ray abnormalities;

Entity relations:
- Has_value("breast x-ray", "abnormalities")